History of severe or multiple allergies

The above is a clinical trial exclusion criterion. Annotated with entity spans:
[Temporal: History] of [Qualifier: severe] or [Qualifier: multiple] [Condition: allergies]